History of pancreatitis

The above is a clinical trial exclusion criterion. Annotated with entity spans:
History of [Condition: pancreatitis]